下列有關嚴重的膽石性胰臟炎的早期處理，何者最不恰當？
A. 抗生素
B. 止痛
C. 液體及電解質補充
D. 馬上開刀進行胰臟清創（debridement）

正確答案：D. 馬上開刀進行胰臟清創（debridement）